Clinical trial exclusion criterion:
Hematochrit >36%

Annotated entities:
- Measurement: "Hematochrit"
- Value: ">36%"